Clinical trial exclusion criterion:
Anterior uveitis or iritis (past or present)

Annotated entities:
- Condition: "Anterior uveitis"
- Condition: "iritis"
- Temporal: "past"
- Temporal: "present"